有關腎臟近端腎小管對於水的再吸收之敘述，下列何者錯誤？
A. 在接近近端腎小管末端內液體，滲透壓會上升至腎小球過濾液的2倍
B. 近端腎小管上皮的頂膜與基底外側有第一型水通道（aquaporin-1）以協助管內水分被快速  	再吸收
C. 近端腎小管約可再吸收腎小球過濾液60～70%的水分
D. 高血糖（例如糖尿病）造成多尿症主要是透過影響近端腎小管水分吸收

正確答案：A. 在接近近端腎小管末端內液體，滲透壓會上升至腎小球過濾液的2倍